Clinical trial inclusion criterion:
2. Have a finding of a mass lesion on ultrasound (BIRADS 0, 4 or 5) that is > 0.5 cm and < 2 cm in size.

Entity relations:
- Has_value("BIRADS", "0, 4 or 5")
- Has_value("size", "> 0.5 cm and < 2 cm")
- AND("mass lesion", "size")
- AND("mass lesion", "ultrasound")
- AND("ultrasound", "BIRADS")